La hipopotasemia es un síntoma fisiológico que típicamente puede presentarse:
1. En los trastornos del sueño.
2. En las adicciones.
3. En la anorexia nerviosa.
4. En la bulimia pero no en la anorexia nerviosa.
5. En los trastornos por déficit de atención y comportamiento perturbador.

Respuesta correcta: 3. En la anorexia nerviosa.